No signs of infection

The above is a clinical trial inclusion criterion. Annotated with entity spans:
[Negation: No] [Condition: signs of infection]